Symptoms of ischaemia.

The above is a clinical trial inclusion criterion. Annotated with entity spans:
[Mood: Symptoms] of [Condition: ischaemia].